3. Have a positive finding on MBI that is < 2 cm in size and requires additional diagnostic workup with focused ultrasound.

The above is a clinical trial inclusion criterion. Annotated with entity spans:
3. Have a [Condition: positive finding] on [Grammar_Error: MBI] that is [Value: < 2 cm] in [Measurement: size] and [Undefined_semantics: requires additional diagnostic workup with focused ultrasound].